Clinical trial exclusion criterion:
Patients with a personal situation judged by the investigator as unlikely to be compatible with optimal participation in the study, or which could constitute a risk for the patient.

Annotated entities:
- Observation: "personal situation"
- Non-representable: "judged by the investigator as unlikely to be compatible with optimal participation in the study"
- Non-query-able: "could constitute a risk for the patient"